一 15 歲女生主訴已有 3 個月腹瀉、腹痛、腹脹感且糞便中有黏液及亮紅色血。理學檢查顯示病人面色蒼白，腹部觸診有瀰漫性輕微腹痛。糞便可見含血且潛血反應呈強陽性。下列何項檢查對診斷最有助益？
A. 下消化道鋇劑攝影
B. 大腸內視鏡檢查
C. 上消化道攝影檢查
D. 腹部電腦斷層掃描

正確答案：B. 大腸內視鏡檢查